一位 26 歲的女性，主訴就診前兩小時喝鹽酸企圖自殺，至急診時生命現象穩定、意識清楚，唯抱怨 喉嚨疼痛，下列處理方式何者為非？
A. 備妥靜脈注射管線（set IV line）補充其水分、電解質
B. 抽動脈血檢查其血中酸鹼度
C. 插鼻管
D. 催吐以避免腸胃道繼續受到化學灼傷

正確答案：D. 催吐以避免腸胃道繼續受到化學灼傷